Clinical trial inclusion criterion:
Previous diagnoses of COPD and HF under optimized clinical treatment as judged by the accompanying physician

Annotated entities:
- Condition: "COPD"
- Condition: "HF"
- Procedure: "clinical treatment"
- Qualifier: "optimized"